La presencia de fosfatidilserina en la superficie celular indica:
1. Senescencia celular.
2. Apoptosis.
3. Necrosis.
4. Mitosis.
5. Estimulación hormonal.

Respuesta correcta: 2. Apoptosis.